40歲李女士約3年前診斷為全身性紅斑狼瘡（systemic lupus erythematosus），除發病時曾有關節腫痛與皮膚紅斑外，近2年病情尚稱穩定。李女士過去驗血就知道血中的抗心脂抗體（anticardiolipin antibodies）很高，為正常上限值的3倍，但過去並不曾發生血管栓塞。本次因左腿急性腫痛至急診室求診，影像學檢查見左腿有深部靜脈栓塞（deep vein thrombosis）。下列處置何者最為適當？
A. 加上aspirin，每日100毫克
B. 加上口服warfarin，希望目標international normalized ratio（INR）2.0～2.5
C. 應立即用高劑量類固醇治療
D. 加上新型抗凝血藥物（new oral anticoagulants, NOAC）

正確答案：B. 加上口服warfarin，希望目標international normalized ratio（INR）2.0～2.5